What 3 organs are the sphincter of Oddi associated with?

The sphincter of oddsi is associated with the pancreatic duct, the duodenal crypts and the gallbladder.